Clinical trial exclusion criterion:
Baseline serology showed a nonreactive RPR test

Annotated entities:
- Temporal: "Baseline"
- Procedure: "serology"
- Value: "nonreactive"
- Measurement: "RPR test"